Clinical trial inclusion criterion:
ASA 2

Annotated entities:
- Condition: "ASA 2"